Clinical trial inclusion criterion:
Histologically proven recurrent or persistent squamous cell carcinoma, adenosquamous carcinoma, or adenocarcinoma of the cervix that is not amenable to curative treatment with surgery and/or radiation therapy AND has failed 2 previous treatment regimens.

Annotated entities:
- Measurement: "Histologically"
- Value: "proven"
- Condition: "squamous cell carcinoma"
- Qualifier: "persistent"
- Qualifier: "recurrent"
- Condition: "adenosquamous carcinoma"
- Condition: "adenocarcinoma of the cervix"
- Qualifier: "amenable to curative treatment"
- Negation: "not"
- Procedure: "surgery"
- Procedure: "radiation therapy"
- Value: "2"
- Procedure: "treatment regimens"
- Temporal: "previous"